Which TREX mRNA export complex subunits have been implicated in neurodevelopmental disorders?

Multiple TREX mRNA export complex subunits, e.g. THOC1, THOC2, THOC5, THOC6, THOC7, have been implicated in neurodevelopmental disorders (NDDs), neurodegeneration and cancer.